那種藥物會抑制IKr channel而使心臟組織動作電位持續時間延長？
A. Atenolol
B. Esmolol
C. Sotalol
D. Carvedilol

正確答案：C. Sotalol